Pregnant or breastfeeding women

The above is a clinical trial exclusion criterion. Annotated with entity spans:
[Condition: Pregnant] or [Condition: breastfeeding] [Person: women]